La información que se puede obtener de una gráfica de Gran es:
1. La longitud de onda de máxima absorción de una molécula.
2. Punto final de una valoración.
3. El punto isosbéstico de una especie ácida.
4. El potencial normal de reducción de una especie electroactiva.

Respuesta correcta: 2. Punto final de una valoración.